Morbidly obese patients (BMI >47 kg/m2) and overweight/lean patients (BMI <27 kg/m2)

The above is a clinical trial exclusion criterion. Annotated with entity spans:
[Condition: Morbidly obese] patients ([Measurement: BMI] [Value: >47 kg/m2]) and [Condition: overweight]/[Condition: lean] patients ([Measurement: BMI] [Value: <27 kg/m2])